Clinical trial inclusion criterion:
Birilubin = 3mg/dl

Entity relations:
- Has_value("Birilubin", "= 3mg/dl")